以下有關精神疾病治療藥物所產生之副作用與其可能作用機制的配對，何者錯誤？
A. 無月經-乳漏（Amenorrhea-galactorrhea）：阻斷多巴胺受體所致
B. 體重增加：阻斷膽鹼受體所致
C. 直立性低血壓（orthostatic hypotension）：阻斷甲型-腎上腺素性受體所致
D. 口乾與尿液滯留：阻斷蕈毒素受體所致

正確答案：B. 體重增加：阻斷膽鹼受體所致